no contra-indication for medical induction of labor

The above is a clinical trial inclusion criterion. Annotated with entity spans:
[Negation: no] [Condition: contra-indication] for [Procedure: medical induction of labor]